Patients participating in another clinical trial within 1 month

The above is a clinical trial exclusion criterion. Annotated with entity spans:
[Competing_trial: Patients participating in another clinical trial within 1 month]